Age equal or greater than 70 years

The above is a clinical trial inclusion criterion. Annotated with entity spans:
[Person: Age] [Value: equal or greater than 70 years]